Clinical trial inclusion criterion:
Compensated liver disease

Annotated entities:
- Condition: "liver disease"
- Qualifier: "Compensated"